Give written informed consent

The above is a clinical trial inclusion criterion. Annotated with entity spans:
[Post-eligibility: Give written informed consent]